Clinical trial inclusion criterion:
Singleton pregnancy at gestational age 36 weeks or more

Annotated entities:
- Condition: "Singleton pregnancy"
- Measurement: "gestational age"
- Value: "36 weeks or more"